下列何者是最常見的胸腺癌（thymic carcinoma）？
A. 腺癌（adenocarcinoma）
B. 淋巴上皮瘤樣癌（lymphoepithelioma-like carcinoma）
C. 神經內分泌癌（neuroendocrine carcinoma）
D. 狀細胞癌（squamous cell carcinoma）

正確答案：D. 狀細胞癌（squamous cell carcinoma）